寄生蟲感染時，往往可藉由釋放各類的抗原（free antigens）達到抑制宿主免疫攻擊之目的，下列關於此類抗原的敘述何者是不正確的：
A. 可結合抗體，因而抑制抗體之生物功能
B. 可造成 B 細胞的耗竭（clonal exhaustion）
C. 可活化 macrophage，進而釋放 prostaglandins
D. 通常活化 Th1 細胞，並促其釋放 IL-10

正確答案：D. 通常活化 Th1 細胞，並促其釋放 IL-10